Clinical trial exclusion criterion:
Known intolerance to one of the two drugs.

Annotated entities:
- Condition: "intolerance"
- Multiplier: "one of the two"
- Drug: "drugs"